Clinical trial inclusion criterion:
Metastatic invasive hormone receptor positive and HER2 negative breast cancer (histologically confirmed).

Annotated entities:
- Condition: "breast cancer"
- Qualifier: "invasive"
- Qualifier: "Metastatic"
- Qualifier: "hormone receptor positive"
- Qualifier: "HER2 negative"
- Non-query-able: "histologically confirmed"